有關排便和排氣的 anorectal sensory receptor 是位在直腸的那一層構造？
A. 黏膜層
B. 黏膜下層
C. 肌肉層
D. 漿膜層

正確答案：C. 肌肉層